胎兒監視器可協助臨床醫師追蹤及觀察胎兒心跳（fetal heart rate pattern）與母親子宮收縮 （uterine contraction）的狀況。當臨床上發現胎兒心跳呈現正弦波狀（sinusoidal fetal heart rate）時，最可能與下列何種臨床情況有關係？
A. 母親有發燒的情形
B. 母親有貧血的情形
C. 胎兒有貧血的情形
D. 胎頭受到壓迫

正確答案：C. 胎兒有貧血的情形